下列何者負責小腦天幕（cerebellar tentorium）之一般感覺？
A. 三叉神經之第三枝
B. 三叉神經之第二枝
C. 三叉神經之第一枝
D. 枕大神經

正確答案：C. 三叉神經之第一枝